引起集體性食物中毒的最大原因是下列那一項？
A. 食物添加物過量
B. 農藥殘留
C. 細菌性污染
D. 天然食物毒性

正確答案：C. 細菌性污染